Clinical trial exclusion criterion:
Electrocardiographic abnormalities or organic heart diseases;

Entity relations:
- Has_qualifier("heart diseases", "organic")
- multi("Electrocardiographic abnormalities", "Electrocardiographic")
- OR("Electrocardiographic abnormalities", "heart diseases")